Musculoskeletal disorders preventing the subject to perform physical training

The above is a clinical trial exclusion criterion. Annotated with entity spans:
[Condition: Musculoskeletal disorders] [Qualifier: preventing the subject to perform physical training]